Clinical trial exclusion criterion:
Unable to complete baseline testing, pre-existing neurological deficit

Annotated entities:
- Non-query-able: "Unable to complete baseline testing"
- Condition: "neurological deficit"
- Qualifier: "pre-existing"